Clinical trial inclusion criterion:
Completed the CRISS questionnaire at Visit 1 and Visit 2 and willing to complete the Cystic Fibrosis Respiratory Symptoms Diary (CFRSD) questionnaire at Visit 3

Annotated entities:
- Procedure: "CRISS questionnaire"
- Temporal: "at Visit 1"
- Temporal: "at Visit 2"
- Reference_point: "Visit 1"
- Reference_point: "Visit 2"
- Mood: "willing to complete"
- Procedure: "Cystic Fibrosis Respiratory Symptoms Diary (CFRSD) questionnaire"
- Temporal: "at Visit 3"
- Reference_point: "Visit 3"